Male or female patients at least 18 years of age.

The above is a clinical trial inclusion criterion. Annotated with entity spans:
[Person: Male] or [Person: female] patients [Value: at least 18 years] of [Person: age].